Clinical trial inclusion criterion:
Under lamivudine/adefovir treatment for more than 1 year due to previous lamivudine resistance (LAM-R), current HBV DNA is undetectable (< 20 IU/ml) during enrollment.

Entity relations:
- Has_index("during enrollment", "enrollment")
- Has_value("HBV DNA", "undetectable")
- Subsumes("undetectable", "< 20 IU/ml")
- Subsumes("lamivudine resistance", "LAM-R")
- Has_temporal("lamivudine", "more than 1 year")
- Has_context("lamivudine", "lamivudine resistance")
- Has_temporal("adefovir", "more than 1 year")
- Has_context("adefovir", "lamivudine resistance")